El tratamiento de 1-hexino con 1 mol de bromuro de hidrógeno da lugar a:
1. 1-bromo-1-hexeno.
2. 1-bromo-2-hexeno.
3. 1-bromo-3-hexeno.
4. 2-bromo-1-hexeno.
5. 2-bromo-2-hexeno.

Respuesta correcta: 4. 2-bromo-1-hexeno.